Clinical trial inclusion criterion:
• History of uveitis confirmed by an ophthalmologist

Annotated entities:
- Condition: "uveitis"
- Non-representable: "confirmed by an ophthalmologist"
- Temporal: "History"